在穩定性心絞痛的病人，使用冠狀動脈繞道手術（CABG）或經皮冠狀動脈氣球擴張術（PTCA），結果都相當好，但在下列那一族群病人，CABG 確實比 PTCA 長期效果來得好？
A. 高血脂病人
B. 糖尿病病人
C. 慢性腎衰竭病人
D. 肝硬化病人

正確答案：B. 糖尿病病人